In the Investigator's opinion, is at high risk for infection (e.g., indwelling catheter, dysphagia with aspiration, decubitus ulcer, history of prior aspiration pneumonia or recurrent urinary tract infection)

The above is a clinical trial exclusion criterion. Annotated with entity spans:
In the Investigator's opinion, is at [Qualifier: high] [Observation: risk for infection] (e.g., [Device: indwelling catheter], [Condition: dysphagia] with [Condition: aspiration], [Condition: decubitus ulcer], history of prior [Condition: aspiration pneumonia] or [Qualifier: recurrent] [Condition: urinary tract infection])